El tálamo forma parte de:
1. El diencéfalo.
2. El mesencéfalo.
3. El telencéfalo.
4. El metencéfalo.
5. El bulbo.

Respuesta correcta: 1. El diencéfalo.